Clinical trial exclusion criterion:
Patient allergic to a penicillin or a carbapenem

Entity relations:
- AND("allergic", "penicillin")
- OR("penicillin", "carbapenem")